the legal guardians participate in all the planned follow-up and be able to comply with all research procedures

The above is a clinical trial inclusion criterion. Annotated with entity spans:
[Post-eligibility: the legal guardians participate in all the planned follow-up and be able to comply with all research procedures]